Written informed consent of parent or guardian

The above is a clinical trial inclusion criterion. Annotated with entity spans:
[Informed_consent: Written informed consent of parent or guardian]